Clinical trial inclusion criterion:
3. Patients with DN must have had Type I or II diabetes and painful distal symmetric sensorimotor polyneuropathy with or without dynamic allodynia of the lower extremities

Annotated entities:
- Condition: "DN"
- Condition: "Type I diabetes"
- Condition: "Type II diabetes"
- Qualifier: "painful"
- Qualifier: "distal"
- Qualifier: "symmetric"
- Condition: "sensorimotor polyneuropathy"
- Condition: "dynamic allodynia"